Clinical trial inclusion criterion:
Fasting plasma glucose between 200-300 mg/dl (A1C level between 7% and 10%).

Annotated entities:
- Measurement: "Fasting plasma glucose"
- Value: "between 200-300 mg/dl"
- Measurement: "A1C level"
- Value: "between 7% and 10%"